下列何者不是第一型雙極性疾患（bipolar I disorder）預後較差的危險因子？
A. 男性
B. 發作時伴隨有精神病症狀
C. 個案發病年齡較大
D. 合併酒精依賴

正確答案：C. 個案發病年齡較大